Severe hepatocellular insufficiency (ASAT or ALAT > 5N, or bilirubin > 2N)

The above is a clinical trial exclusion criterion. Annotated with entity spans:
Severe [Condition: hepatocellular insufficiency] ([Measurement: ASAT] or [Measurement: ALAT] [Value: > 5N], or [Measurement: bilirubin] [Value: > 2N])